Clinical trial exclusion criterion:
known allergy to clopidogrel or acetylsalicylic acid precluding its administration as specified by the protocol

Annotated entities:
- Drug: "clopidogrel"
- Drug: "acetylsalicylic acid"
- Condition: "allergy"
- Non-representable: "precluding its administration"